Heart disease, kidney disease or diabetes

The above is a clinical trial exclusion criterion. Annotated with entity spans:
[Condition: Heart disease], [Condition: kidney disease] or [Condition: diabetes]